Clinical trial inclusion criterion:
3 -15 years old

Annotated entities:
- Value: "3 -15 years"
- Person: "old"